usage of painkiller before surgery

The above is a clinical trial exclusion criterion. Annotated with entity spans:
usage of [Drug: painkiller] [Temporal: before surgery]